patients with renal cancer coming to the laparoscopic radical nephrectomy

The above is a clinical trial inclusion criterion. Annotated with entity spans:
patients with [Condition: renal cancer] coming to the [Qualifier: laparoscopic] [Procedure: radical nephrectomy]